El vector de la fiebre del valle del Rift es un:
1. Mosquito.
2. Garrapata.
3. Piojo.
4. Pulga.

Respuesta correcta: 1. Mosquito.